王醫師工作一向相當繁忙，因此將他的醫師職章交由專科護理師幫忙書寫病歷、開立例行性醫囑。依照現行法規以及衛生福利部的解釋函，下列敘述何者正確？
A. 這些醫療行為屬於醫療輔助行為，由專科護理師來進行並無不當
B. 只要專科護理師在進行病歷書寫及開立醫囑後，確實蓋上負責醫師的職章，即符合相關法律規定
C. 這些醫療行為雖能由專科護理師輔助醫師為之，但不能由專科護理師代為之
D. 這些醫療行為屬於常態性的醫療慣行，並無不當

正確答案：C. 這些醫療行為雖能由專科護理師輔助醫師為之，但不能由專科護理師代為之